MI within 6 mo and LVEF < 45%

The above is a clinical trial exclusion criterion. Annotated with entity spans:
[Condition: MI] [Temporal: within 6 mo] and [Measurement: LVEF] [Value: < 45%]